Clinical trial exclusion criterion:
1. History of uncontrolled hypertension

Entity relations:
- Has_qualifier("hypertension", "uncontrolled")
- Has_temporal("hypertension", "History")